What is the preferred orientation of CTCF binding sites for chromatin looping?

As recently reported, our data also suggest that chromatin loops preferentially form between CTCF binding sites oriented in a convergent manner. Recent studies identified a correlation between the orientation of CTCF-binding sites  and chromatin loops. Recent reports have suggested that CTCF binding is more dynamic during development than previously appreciated.